Clinical trial exclusion criterion:
Subjects that are unable to lay flat due to pulmonary complications, increased intracranial pressure (ICP), or unstable spinal cord injuries

Annotated entities:
- Condition: "unable to lay flat"
- Condition: "pulmonary complications"
- Qualifier: "due to pulmonary complications"
- Condition: "increased intracranial pressure (ICP)"
- Condition: "spinal cord injuries"
- Qualifier: "unstable"